Clinical trial exclusion criterion:
previous adverse reaction or known allergy to local anaesthetics or opioids or paracetamol

Entity relations:
- AND("adverse reaction", "local anaesthetics")
- OR("adverse reaction", "allergy")
- OR("local anaesthetics", "opioids", "paracetamol")